Clinical trial inclusion criterion:
High risk for thromboembolic events (i.e., CHADS2 score = 2 or CHA2DS2-VASc score = 3) and require OAT before undergoing cardiac ablation

Entity relations:
- Has_value("risk for thromboembolic events", "High")
- Has_index("before undergoing cardiac ablation", "cardiac ablation")
- Has_temporal("OAT", "before undergoing cardiac ablation")
- Has_value("CHADS2 score", "= 2")
- Has_value("CHA2DS2-VASc score", "= 3")
- Subsumes("risk for thromboembolic events", "CHADS2 score")
- OR("CHADS2 score", "CHA2DS2-VASc score")